ECOG Performance Status 0-1

The above is a clinical trial inclusion criterion. Annotated with entity spans:
[Measurement: ECOG Performance Status] [Value: 0-1]